participant taken an opioid or an opioid like analgesic within 24 hours

The above is a clinical trial exclusion criterion. Annotated with entity spans:
participant taken an [Drug: opioid] or an [Drug: opioid like analgesic] [Temporal: within 24 hours]